Clinical trial inclusion criterion:
Receptors of a first kidney transplant from an incompatible HLA living donor (at least 1 mismatch HLA at any antigenic level).

Entity relations:
- Has_qualifier("first kidney transplant", "incompatible HLA")
- Has_qualifier("first kidney transplant", "living donor")
- Has_multiplier("mismatch HLA", "at least 1")
- Has_context("first kidney transplant", "mismatch HLA")